Clinical trial exclusion criterion:
With bad compliance or contraindication to enrollment.

Entity relations:
- OR("bad compliance", "contraindication to enrollment")